Clinical trial inclusion criterion:
Eastern Cooperative Oncology Group (ECOG) Performance status ≤ 2

Annotated entities:
- Measurement: "Eastern Cooperative Oncology Group (ECOG) Performance status"
- Value: "≤ 2"